patients allergic to misoprostol;

The above is a clinical trial exclusion criterion. Annotated with entity spans:
patients [Condition: allergic] to [Drug: misoprostol];